Clinical trial inclusion criterion:
No history of PPD allergic contact dermatitis, with a negative PPD patch test.

Annotated entities:
- Condition: "allergic contact dermatitis"
- Drug: "PPD"
- Negation: "No"
- Measurement: "PPD patch test"
- Value: "negative"